Healthy men and women, age 40-75 yrs, without any disease and need of medication.

The above is a clinical trial inclusion criterion. Annotated with entity spans:
[Qualifier: Healthy] [Person: men] and [Person: women], [Person: age] [Value: 40-75 yr]s, [Negation: without] [Qualifier: any] [Condition: disease] and need of [Procedure: medication].